Clinical trial exclusion criterion:
Stroke, transient ischemic attack, acute coronary syndrome, or hospitalization for heart failure worsening, within the previous 30 days.

Annotated entities:
- Condition: "Stroke"
- Condition: "transient ischemic attack"
- Condition: "acute coronary syndrome"
- Procedure: "hospitalization"
- Condition: "heart failure"
- Qualifier: "worsening"
- Temporal: "within the previous 30 days"